病人於腹部手術後，如果經評估後有發生腹部腔室症候群（abdominal compartment syndrome）的風險時，應採取下列何種措施？
A. 供給氧氣
B. 供給大量輸液
C. 避免將傷口做初期縫合（primary closure）
D. 放置中央靜脈導管（central venous catheter）

正確答案：C. 避免將傷口做初期縫合（primary closure）